Clinical trial exclusion criterion:
Under beta-blocker treatment for the last 2 weeks.

Entity relations:
- Has_temporal("beta-blocker", "for the last 2 weeks")